Clinical trial exclusion criterion:
16. Subject has normal or insignificant coronaries (i.e. coronary lesion(s) less than 50% stenosis).

Annotated entities:
- Condition: "coronary lesion"
- Measurement: "coronary lesion"
- Value: "less than 50% stenosis"
- Condition: "stenosis"